Clinical trial exclusion criterion:
Malignancies or other comorbid conditions with life expectancy less than 12 months or that may result in protocol noncompliance

Entity relations:
- Has_qualifier("comorbid conditions", "other")
- Has_mood("protocol noncompliance", "may")
- Has_value("life expectancy", "less than 12 months")
- Has_context("Malignancies", "life expectancy")
- OR("life expectancy", "protocol noncompliance")
- OR("Malignancies", "comorbid conditions")